American Society of Anesthesiology (ASA) I-III;

The above is a clinical trial inclusion criterion. Annotated with entity spans:
[Measurement: American Society of Anesthesiology (ASA)] [Value: I-III];